Clinical trial inclusion criterion:
Children undergoing elective tonsillectomy or adenotonsillectomy at Children's Healthcare of Atlanta Egleston location

Annotated entities:
- Person: "Children"
- Qualifier: "elective"
- Procedure: "tonsillectomy"
- Procedure: "adenotonsillectomy"
- Visit: "Children's Healthcare of Atlanta Egleston"